Subjects for whom a single dose of 1.0 milligram (mg) dexamethasone acetate may be contraindicated

The above is a clinical trial exclusion criterion. Annotated with entity spans:
Subjects for whom a [Multiplier: single] [Multiplier: dose of 1.0 milligram (mg)] [Drug: dexamethasone acetate] may be [Condition: contraindicated]